Clinical trial exclusion criterion:
Evidence of current severe major depressive disorder or suicidal ideation

Annotated entities:
- Condition: "major depressive disorder"
- Qualifier: "severe"
- Condition: "suicidal ideation"